對於不同強度的感覺刺激，神經纖維的主要變化參數為何？
A. frequency of action potential
B. amplitude of action potential
C. duration of each action potential
D. latency of receptor potential

正確答案：A. frequency of action potential